Clinical trial exclusion criterion:
Other ocular pathologies that in the investigator's opinion would interfere with the subject's vision in the study eye.

Entity relations:
- Has_context("ocular pathologies", "would interfere with the subject's vision in the study eye")
- Has_qualifier("ocular pathologies", "Other")